Which are the mutational hotspots of the human KRAS oncogene?

The KRAS oncogene has four main mutational hotspots located at codons 12, 13, 61 and 146.